Clinical trial exclusion criterion:
Preexisting untreated medical condition (thyroid disease, diabetes mellitus, hypertension, pulmonary conditions, cardiac condition…)

Entity relations:
- Has_qualifier("medical condition", "untreated")
- AND("medical condition", "thyroid disease")
- Has_qualifier("medical condition", "Preexisting")
- OR("thyroid disease", "diabetes mellitus", "hypertension", "pulmonary conditions", "cardiac condition")